Clinical trial exclusion criterion:
Cardiac troponin I ≥ 0.2 ng/mL within 28 days of randomization.

Annotated entities:
- Measurement: "Cardiac troponin I"
- Value: "≥ 0.2 ng/mL"
- Temporal: "within 28 days of randomization"
- Reference_point: "randomization"